Clinical trial exclusion criterion:
A family history of congenital or hereditary immunodeficiency.

Annotated entities:
- Observation: "family history"
- Condition: "congenital immunodeficiency"
- Condition: "hereditary immunodeficiency"